Clinical trial exclusion criterion:
Signs of kidney injury/failure

Entity relations:
- Has_mood("kidney injury", "Signs of")
- OR("kidney injury", "kidney failure")